Clinical trial exclusion criterion:
recent or concomitant use of corticosteroids

Entity relations:
- Has_temporal("corticosteroids", "recent")
- OR("recent", "concomitant")